關於淚液的流向，下列何者錯誤？
A. 淚腺分泌淚液經由淚管（lacrimal ducts）釋入結膜囊（conjunctival sac）
B. 淚湖（lacrimal lake）中之淚液流入淚點（lacrimal puncta）
C. 淚小管（lacrimal canaliculi）將淚液導入淚囊（lacrimal sac）
D. 鼻淚管（nasolacrimal duct）開口於鼻腔之中鼻道（middle meatus）

正確答案：D. 鼻淚管（nasolacrimal duct）開口於鼻腔之中鼻道（middle meatus）